Clinical trial exclusion criterion:
NA

Annotated entities:
- Non-query-able: "NA"